Clinical trial exclusion criterion:
Patients with severe complications or severe infection;

Entity relations:
- Has_qualifier("complications", "severe")
- Has_qualifier("infection", "severe")
- OR("complications", "infection")